Clinical trial exclusion criterion:
6. daily use of opioids for pain

Annotated entities:
- Drug: "opioids"
- Condition: "pain"
- Multiplier: "daily"